Clinical trial exclusion criterion:
Evidence of an acute myocardial infarction = 1 month (30 days) before the intended treatment [defined as: Q wave MI, or non-Q wave MI with total CK elevation of CK-MB = twice normal in the presence of MB elevation and/or troponin level elevation (WHO definition)].

Annotated entities:
- Condition: "acute myocardial infarction"
- Temporal: "= 1 month (30 days) before the intended treatment"